Clinical trial exclusion criterion:
Previous treatment by chemoembolization, radiofrequency less than 3 months before radioembolization

Entity relations:
- Has_index("less than 3 months before radioembolization", "radioembolization")
- Has_temporal("chemoembolization", "less than 3 months before radioembolization")
- OR("chemoembolization", "radiofrequency")